Which is the  subcellular localization of ERAP2?

Endoplasmic reticulum aminopeptidase 2 (ERAP2) is localized to the luminal side of the endoplasmic reticulum.